Clinical trial inclusion criterion:
Healthy Volunteers:

Annotated entities:
- Parsing_Error: "Healthy Volunteers:"